Clinical trial exclusion criterion:
Current use of any active systemic medication for chronic atopic dermatitis within one month

Entity relations:
- Has_temporal("chronic atopic dermatitis", "within one month")
- Has_temporal("systemic medication", "active")
- AND("systemic medication", "chronic atopic dermatitis")